Clinical trial exclusion criterion:
Any major psychiatric disorder, such as severe depression, severe anxiety disorder, psychosis, schizophrenia, other major psychiatric disorders, or seizures. History of mild depression or anxiety disorder that are well controlled are not exclusion criteria.

Entity relations:
- Has_qualifier("depression", "severe")
- Has_qualifier("anxiety disorder", "severe")
- Has_qualifier("major psychiatric disorders", "other")
- Has_qualifier("depression", "mild")
- Has_qualifier("depression", "well controlled")
- Has_negation("depression", "not")
- Subsumes("major psychiatric disorder", "depression")
- OR("depression", "anxiety disorder")
- OR("depression", "major psychiatric disorders", "schizophrenia", "psychosis", "anxiety disorder", "seizures")